Clinical trial inclusion criterion:
>= 18 years

Entity relations:
- Has_value("years", ">= 18")